Clinical trial inclusion criterion:
Women of child-bearing potential (WCBP) must have a negative serum pregnancy test 72 hours or less prior to starting treatment

Entity relations:
- Subsumes("child-bearing potential", "WCBP")
- multi("starting treatment", "treatment")
- multi("72 hours or less prior to starting treatment", "starting treatment")
- Has_temporal("serum pregnancy test", "72 hours or less prior to starting treatment")
- Has_value("serum pregnancy test", "negative")
- AND("Women", "serum pregnancy test")
- Subsumes("Women", "WCBP")
- AND("child-bearing potential", "serum pregnancy test")